Clinical trial exclusion criterion:
Infection with hepatitis B virus (HBV) or human immunodeficiency virus (HIV)

Annotated entities:
- Condition: "hepatitis B virus (HBV)"
- Condition: "human immunodeficiency virus (HIV)"